Clinical trial exclusion criterion:
Severe cardiovascular, hepatic, renal disease or neurological impairment.

Annotated entities:
- Condition: "disease cardiovascular"
- Condition: "hepatic disease"
- Condition: "renal disease"
- Condition: "neurological impairment"